La prueba de la tuberculina es un ejemplo de ensayo de:
1. La respuesta inmunitaria innata.
2. La respuesta inmunitaria adaptativa.
3. Citotoxicidad.
4. Prueba específica de inmunodeficiencia.

Respuesta correcta: 2. La respuesta inmunitaria adaptativa.